下列有關蟯蟲（Enterobius vermicularis）感染的敘述，何者錯誤？
A. 蟲卵可藉空氣傳播感染人體
B. 感染後易干擾夜間睡眠
C. 婦女感染後有可能引起骨盆腔腹膜炎（chronic pelvic peritonitis）
D. 最正確的診斷方式為檢查患者糞便中的蟲卵

正確答案：D. 最正確的診斷方式為檢查患者糞便中的蟲卵